Poorly controlled hypertension as assessed by the investigator

The above is a clinical trial exclusion criterion. Annotated with entity spans:
[Qualifier: Poorly controlled] [Condition: hypertension] as assessed by the investigator